Clinical trial exclusion criterion:
Current use of a positive airway pressure device (including continuous or bi-level positive airway pressure or adaptive servo-ventilation) or supplemental oxygen therapy

Annotated entities:
- Device: "positive airway pressure device"
- Device: "bi-level positive airway pressure"
- Device: "continuous airway pressure"
- Device: "adaptive servo-ventilation"
- Procedure: "supplemental oxygen therapy"